Which are the best methods for the prediction of circular RNA (circRNA)?

The best methods for the prediction of circular RNA are: circRNA_finder, find_circ, CIRCexplorer, CIRI, MapSplice, UROBORUS, Circ TEST DCC and miARma-Seq.